Expectation that patient will not improve despite treatment of tricuspid regurgitation

The above is a clinical trial exclusion criterion. Annotated with entity spans:
[Non-query-able: Expectation that patient will not improve despite treatment of tricuspid regurgitation]